Clinical trial exclusion criterion:
Subject has scoliosis of greater than ten (10) degrees (both angular and rotational).

Entity relations:
- Has_qualifier("scoliosis", "greater than ten (10) degrees")
- Has_qualifier("scoliosis", "angular")
- OR("angular", "rotational")